History of immunologically mediated disease (e.g., inflammatory bowel disease, idiopathic thrombocytopenic purpura, lupus erythematosus, autoimmune hemolytic anemia, scleroderma, severe psoriasis, rheumatoid arthritis).

The above is a clinical trial exclusion criterion. Annotated with entity spans:
History of [Condition: immunologically mediated disease] (e.g., [Condition: inflammatory bowel disease], [Condition: idiopathic thrombocytopenic purpura], [Condition: lupus erythematosus], [Condition: autoimmune hemolytic anemia], [Condition: scleroderma], [Qualifier: severe] [Condition: psoriasis], [Condition: rheumatoid arthritis]).